Any clinically significant laboratory test result

The above is a clinical trial exclusion criterion. Annotated with entity spans:
[Undefined_semantics: Any clinically significant laboratory test result]